Clinical trial exclusion criterion:
History of transurethral resection of the prostate (TURP), open prostate surgery, or radiofrequency or microwave therapies

Entity relations:
- OR("transurethral resection of the prostate (TURP)", "radiofrequency", "open prostate surgery", "microwave therapies")